Clinical trial inclusion criterion:
Baseline DAS28/Erythrocyte Sedimentation Rate (ESR) >=3.2

Entity relations:
- Has_value("DAS28/Erythrocyte Sedimentation Rate (ESR)", ">=3.2")
- Has_temporal("DAS28/Erythrocyte Sedimentation Rate (ESR)", "Baseline")